Clinical trial exclusion criterion:
pregnancy or lactating women

Entity relations:
- OR("pregnancy", "lactating")